Normal renal function (defined as serum creatinine level <133 µmol/L and Estimated Glomerular Filtration Rate (eGFR) greater than or equal to 60)

The above is a clinical trial inclusion criterion. Annotated with entity spans:
[Condition: Normal renal function] (defined as [Measurement: serum creatinine level] [Value: <133 µmol/L] and [Measurement: Estimated Glomerular Filtration Rate (eGFR)] [Value: greater than or equal to 60])